Which thyroid hormone transporter is implicated in thyroid hormone resistance syndrome?

Hemizygous MCT8 mutations cuases TH resistance syndrome in males characterized by severe psychomotor retardation, known as the Allan-Herndon-Dudley syndrome (AHDS).